下列骨盆底的肌肉群中，那一肌肉不屬於提肛肌（levator ani muscle）？
A. pubococcygeus muscle
B. iliococcygeus muscle
C. coccygeus muscle
D. puborectalis muscle

正確答案：C. coccygeus muscle